Clinical trial exclusion criterion:
History of eclampsia or other adverse CNS complication (e.g., stroke or PRES) in this pregnancy

Entity relations:
- AND("CNS complication", "stroke")
- Has_temporal("eclampsia", "in this pregnancy")
- OR("stroke", "PRES")
- OR("eclampsia", "CNS complication")